What is caused by de novo sox6 variants?

De novo SOX6 variants cause a neurodevelopmental syndrome associated with ADHD, Craniosynostosis, and Osteochondromas.